Subjects receiving chronic or prophylactic antibiotic therapy.

The above is a clinical trial exclusion criterion. Annotated with entity spans:
Subjects receiving [Procedure: chronic] or [Procedure: prophylactic antibiotic therapy].